Clinical trial exclusion criterion:
chronic diseases e.g. cerebral palsy, metabolic disease, etc.

Entity relations:
- Subsumes("chronic diseases", "cerebral palsy")
- OR("cerebral palsy", "metabolic disease")